Clinical trial exclusion criterion:
Seborrheic eczema, Seborrheic conjunctivitis

Annotated entities:
- Condition: "Seborrheic eczema"
- Condition: "Seborrheic conjunctivitis"